El Programa de Actividades Preventivas y de Promoción de la Salud (PAPPS) NO incluye como paquete mínimo en el Subprograma Infantil:
1. Cribado de hipotiroidismo congénito.
2. Promoción de lactancia materna.
3. Prevención de embarazo y enfermedades de transmisión sexual en adolescente.
4. Prevención del suicidio.
5. Prevención del tabaquismo activo y pasivo.

Respuesta correcta: 4. Prevención del suicidio.